suspicion of nonfunctional P-NET on primary CT (i.e hypervascularity) or MRI

The above is a clinical trial inclusion criterion. Annotated with entity spans:
[Mood: suspicion] of [Condition: nonfunctional P-NET] on [Procedure: primary CT] (i.e [Condition: hypervascularity]) or [Procedure: MRI]